對於篩檢常見內分泌疾病之措施，何者錯誤？
A. 甲狀腺低能症－測 TSH
B. 多囊泡卵巢症－測 estradiol、progesterone
C. 勃起失能－測乳促素、睪固酮
D. 葛雷瑞夫氏症－測 Free T4、TSH

正確答案：B. 多囊泡卵巢症－測 estradiol、progesterone